關於退化性關節炎（osteoarthritis）的敘述，下列何者錯誤？
A. 是一種常見的關節炎，好發於年紀較大的病人
B. 好發的關節包括手部的distal interphalangeal（DIP）joints、hip joints及knee joints
C. 關節的X ray檢查常會發現narrowed joint space，但通常不會有bone erosion的情形
D. 因為關節有發炎，因此病人血中的CRP和ESR值常會有上升的情形

正確答案：D. 因為關節有發炎，因此病人血中的CRP和ESR值常會有上升的情形